Clinical trial inclusion criterion:
Female subjects of childbearing potential must agree to use highly effective birth control methods.

Entity relations:
- AND("Female", "childbearing potential")
- AND("Female", "birth control methods")